Clinical trial inclusion criterion:
normotensive

Annotated entities:
- Condition: "normotensive"